combined surgical procedures

The above is a clinical trial exclusion criterion. Annotated with entity spans:
[Procedure: combined surgical procedures]